小腦受損的病人，對下列何種學習能力會顯得較為低弱？
A. 記得剛認識的人的名字
B. 學習彈奏樂器
C. 記路，所以比較容易迷路
D. 學習心算

正確答案：B. 學習彈奏樂器